Clinical trial exclusion criterion:
Presence of VTE upon admission

Annotated entities:
- Condition: "VTE"
- Temporal: "upon admission"